Clinical trial exclusion criterion:
corticosteroid use during last 3 months

Annotated entities:
- Drug: "corticosteroid"
- Temporal: "during last 3 months"